Clinical trial exclusion criterion:
Patients with known or suspected heparin induced thrombocytopenia prior to consent

Annotated entities:
- Drug: "heparin"
- Condition: "thrombocytopenia"
- Temporal: "prior to consent"
- Reference_point: "consent"
- Qualifier: "heparin induced"
- Mood: "suspected"
- Mood: "known"